Clinical trial exclusion criterion:
Patient is expecting or has had major cardiac surgery within last two months.

Annotated entities:
- Procedure: "major cardiac surgery"
- Temporal: "last two months"